有關右眼之右視野（即外側視野）訊息之敘述，何者正確？
A. 經由 right optic nerve 傳遞，在 optic chiasm 交叉，然後經由 left optic tract 傳至左側 thalamus
B. 經由 right optic nerve 傳遞，在 optic chiasm 不交叉，然後經由 right optic tract 傳至右側 thalamus
C. 經由 right optic tract 傳遞，在 optic chiasm 交叉，然後經由 left optic radiation 傳至左側 thalamus
D. 經由 right optic tract 傳遞，在 optic chiasm 不交叉，然後經由 right optic radiation 傳至右側 thalamus

正確答案：A. 經由 right optic nerve 傳遞，在 optic chiasm 交叉，然後經由 left optic tract 傳至左側 thalamus